Currently taking systemic steroids or other immunomodulatory medications including anticancer medications and antiviral medications

The above is a clinical trial exclusion criterion. Annotated with entity spans:
Currently taking [Drug: systemic steroids] or other [Procedure: immunomodulatory medications] including [Procedure: anticancer medications] and [Procedure: antiviral medications]